The patient was confirmed to have a history of gastric ulcer or duodenal ulcer.

The above is a clinical trial inclusion criterion. Annotated with entity spans:
The patient was confirmed to have a [Temporal: history] of [Condition: gastric ulcer] or [Condition: duodenal ulcer].